Wound healing issues at time of possible conversion (eg, wound dehiscence, wound infection, incisional hernia, lymphocele, seroma)

The above is a clinical trial exclusion criterion. Annotated with entity spans:
[Condition: Wound healing issues] [Temporal: at time of possible conversion] (eg, [Condition: wound dehiscence], [Condition: wound infection], [Condition: incisional hernia], [Condition: lymphocele], [Condition: seroma])